tramadol

The above is a clinical trial exclusion criterion. Annotated with entity spans:
[Drug: tramadol]